Previous prescription of mineralocorticoid receptor antagonists, for cCSC or for other diseases;

The above is a clinical trial exclusion criterion. Annotated with entity spans:
[Temporal: Previous] prescription of [Drug: mineralocorticoid receptor antagonists], for [Condition: cCSC] or for [Condition: other diseases];